下列那一項不是次發性腎上腺機能不全（secondary adrenal insufficiency）的臨床表徵？
A. 低血壓（hypotension）
B. 低血糖（hypoglycemia）
C. 低血鈉（hyponatremia）
D. 低血鈣（hypocalcemia）

正確答案：D. 低血鈣（hypocalcemia）